Female patients must have a negative serum pregnancy test at screening. (Not applicable to patients with bilateral oophorectomy and/or hysterectomy or to those patients who are postmenopausal.)

The above is a clinical trial inclusion criterion. Annotated with entity spans:
[Person: Female] patients must have a [Value: negative] [Measurement: serum pregnancy test] [Temporal: at screening]. (Not applicable to patients with [Procedure: bilateral oophorectomy] and/or [Procedure: hysterectomy] or to those patients who are [Condition: postmenopausal].)